Clinical trial exclusion criterion:
Scar diathesis;

Annotated entities:
- Condition: "Scar diathesis"